Clinical trial inclusion criterion:
Patients who responded inadequately (a score of >18 on the MADRS) to first-line antidepressant treatment of 4 week duration

Annotated entities:
- Measurement: "MADRS"
- Value: "score of >18"
- Qualifier: "first-line"
- Drug: "antidepressant"
- Temporal: "of 4 week"
- Observation: "responded inadequately"